一位25歲的女性病人因為最近一週發生胸悶而求診，胸悶的發作與活動無關；身體診察時在胸骨旁左下緣可聽見收縮中期滴答聲（mid-systolic click）以及第二度收縮末期雜音（late systolic murmur），下列何項是確認診斷的最佳診斷工具？
A. 標準12-導程心電圖
B. 胸部X-光片
C. 電腦斷層檢查
D. 心臟超音波

正確答案：D. 心臟超音波